Clinical trial inclusion criterion:
Willing to return for follow up Visit 3

Annotated entities:
- Mood: "Willing to"
- Procedure: "follow up Visit 3"